Planned cardiac surgery or planned major non cardiac surgery

The above is a clinical trial exclusion criterion. Annotated with entity spans:
[Mood: Planned] [Procedure: cardiac surgery] or [Mood: planned] [Qualifier: major] [Procedure: non cardiac surgery]